有關類風濕性關節炎（rheumatoid arthritis）病患的復健治療，下列敘述何者錯誤？
A. 目標是避免關節變形，維持活動功能
B. 必要時需使用輔具矯正變形關節
C. 物理治療最為重要，大多數病人不需職能治療
D. 須配合居家與工作環境適應

正確答案：C. 物理治療最為重要，大多數病人不需職能治療